Clinical trial exclusion criterion:
Surgical treatment history (except anti-reflux treatment) or esophageal radiotherapy,

Annotated entities:
- Procedure: "Surgical treatment"
- Temporal: "history"
- Procedure: "anti-reflux treatment"
- Negation: "except"
- Procedure: "esophageal radiotherapy"